¿A cuál de las siguientes variables se han asociado los mejores resultados terapéuticos en la Fobia Social?:
1. Entrenamiento en HHSS.
2. Apoyo familiar.
3. Cumplimiento de las tareas de exposición entre sesiones.
4. Experiencia previa en psicoterapia.
5. Ausencia de síntomas fisiológicos.

Respuesta correcta: 3. Cumplimiento de las tareas de exposición entre sesiones.